Clinical trial exclusion criterion:
HCV, HIV, or HDV coinfection.

Entity relations:
- OR("HCV coinfection", "coinfection HIV", "HDV coinfection")